Clinical trial exclusion criterion:
8. Patients on methotrexate.

Annotated entities:
- Drug: "methotrexate"